全胃切除的病人，可能產生下列何種疾病？
A. 夜盲症
B. 貧血
C. 軟骨症
D. 骨質疏鬆症

正確答案：B. 貧血